Clinical trial inclusion criterion:
patients with FEV1 / FVC <70%

Annotated entities:
- Measurement: "FEV1 / FVC"
- Value: "<70%"